Clinical trial exclusion criterion:
Patient included in an interventional study assessing treatment for active proctitis or distal proctosigmoiditis.

Annotated entities:
- Condition: "active proctitis"
- Condition: "distal proctosigmoiditis"
- Procedure: "treatment"
- Undefined_semantics: "treatment"